All patients (excluding neonates) requiring one or more allogeneic RBC transfusions for the treatment of anemia will be included.

The above is a clinical trial inclusion criterion. Annotated with entity spans:
All patients ([Negation: excluding] [Person: neonates]) [Mood: requiring] [Multiplier: one or more] [Qualifier: allogeneic] [Procedure: RBC transfusions] for the [Procedure: treatment] of [Condition: anemia] will be included.